46 歲陳小姐因上腹痛接受胃鏡檢查時，發現在胃體部中間靠胃大彎處有一個 4 公分腫瘤，表面黏膜完整，經內視鏡超音波檢查證實為黏膜下腫瘤，則下列何種處置最適當？
A. 腹腔鏡胃腫瘤切除手術
B. 門診追蹤觀察
C. 經內視鏡腫瘤切除
D. 接受放射線治療

正確答案：A. 腹腔鏡胃腫瘤切除手術